Clinical trial inclusion criterion:
Hospitalization with acute undifferentiated fever (temperature > 37.5 C, tympanic) =14 days or patients admitted to hospital with a history of fever = 14 days who subsequently develop fever within 24 hours of admission

Annotated entities:
- Procedure: "Hospitalization"
- Condition: "acute undifferentiated fever"
- Measurement: "temperature"
- Value: "> 37.5 C"
- Condition: "tympanic"
- Multiplier: "=14 days"
- Temporal: "history"
- Condition: "fever"
- Multiplier: "= 14 days"
- Condition: "fever"
- Temporal: "within 24 hours of admission"
- Procedure: "admitted to hospital"
- Reference_point: "admission"